下列關於第一型人類免疫缺乏病毒（HIV-1）感染之敘述，何者為錯？
A. HIV-1 的共受器 CCR5 基因缺陷者，可以抵抗 HIV-1 之感染
B. 臨床上無症狀期血中無 HIV-1 病毒存在
C. 無藥物治療之下，大多數感染者均會發病產生愛滋病（AIDS）
D. 有極少數感染者長期不發病

正確答案：B. 臨床上無症狀期血中無 HIV-1 病毒存在